Clinical trial exclusion criterion:
Recreational drug use within 2 years before Screening

Annotated entities:
- Observation: "Recreational drug use"
- Temporal: "within 2 years before Screening"
- Reference_point: "Screening"